Clinical trial inclusion criterion:
Covered by the French social care system

Annotated entities:
- Observation: "Covered by the French social care system"